雙鏈 DNA 因加熱而變性（denature）時，在波長 260nm 的照射下，其吸光度（absorbance）有增加的現象，此現象稱為增色效應，其原因為何？
A. 變性時其亂度增加而引起的反應
B. 變性時其體積增加，因而吸光度也隨之而增加
C. 因鹼基中的嘧啶與嘌呤外露而增加其吸光度
D. 因五碳糖和磷酸根外露而增加其吸光度

正確答案：C. 因鹼基中的嘧啶與嘌呤外露而增加其吸光度